Clinical trial exclusion criterion:
Women under the age of 18,

Entity relations:
- Has_value("age", "18 under")